Patient has symptoms of or been diagnosed with a medical condition that may contribute to abdominal pain

The above is a clinical trial exclusion criterion. Annotated with entity spans:
Patient has symptoms of or been diagnosed with a [Condition: medical condition] that [Qualifier: may contribute to abdominal pain]